Clinical trial exclusion criterion:
History of allergic reactions to phenylephrine or ephedrine

Annotated entities:
- Temporal: "History"
- Condition: "allergic reactions"
- Drug: "phenylephrine"
- Drug: "ephedrine"